3. Planned need for major surgery (e.g. valve surgery or resection of aortic or left ventricular aneurysm, carotid end-arterectomy, abdominal aortic aneurysm surgery etc.);

The above is a clinical trial exclusion criterion. Annotated with entity spans:
3. Planned need for [Procedure: major surgery] (e.g. [Procedure: valve surgery] or [Procedure: resection of aortic] or left ventricular aneurysm, [Procedure: carotid end-arterectomy], [Procedure: abdominal aortic aneurysm surgery] etc.);